Clinical trial inclusion criterion:
Normal bone marrow reserve function and normal liver, kidney function

Entity relations:
- Has_value("bone marrow reserve function", "Normal")
- Has_value("liver function", "normal")
- Has_value("kidney function", "normal")
- OR("liver function", "kidney function")